Clinical trial exclusion criterion:
Any phosphodiesterase 5 inhibitor (sildenafil, tadalafil, avanafil, vardenafil) has been taken within 72 hours prior to the study.

Annotated entities:
- Drug: "phosphodiesterase 5 inhibitor"
- Drug: "sildenafil"
- Drug: "tadalafil"
- Drug: "avanafil"
- Drug: "vardenafil"
- Temporal: "within 72 hours prior to the study"
- Reference_point: "study"